一位 34 歲健康女性，G1P1，13 歲初經以來有規則的月經週期，主訴一年半前開始沒有月經。抽血結果顯示：β-hCG＜1.0 mIU/mL；estradiol＜20 pg/mL，FSH＞100 mIU/mL，prolactin＜20 ng/mL。另外她有熱潮紅（hot flash）及性交疼痛（dyspareunia）的問題已影響她的生活。下列敘述何者錯誤？
A. 此病人是一個典型的停經婦女（typical menopausal woman）
B. 此病人與同年齡有月經的女性相比，有較高的骨折和骨質流失的風險
C. 此病人為早發性卵巢衰竭（premature ovarian failure），應接受荷爾蒙補充治療（hormone replacement therapy）
D. 陰道雌激素製劑（vaginal estrogens）有助於改善性交疼痛的問題

正確答案：A. 此病人是一個典型的停經婦女（typical menopausal woman）